Clinical trial inclusion criterion:
age =18 and <75 years;

Entity relations:
- Has_value("age", "=18 and <75 years")